Clinical trial inclusion criterion:
Metastatic endometrial cancer (EM)

Annotated entities:
- Condition: "Metastatic endometrial cancer"